Clinical trial exclusion criterion:
Patients with allergy or intolerance to any of the drugs used.

Annotated entities:
- Condition: "allergy"
- Condition: "intolerance"
- Drug: "drugs"